Clinical trial exclusion criterion:
Stoma

Annotated entities:
- Condition: "Stoma"